Clinical trial inclusion criterion:
Age from birth to 21 years

Annotated entities:
- Value: "from birth to 21 years"
- Person: "Age"